Clinical trial inclusion criterion:
4. Capable of providing informed consent.

Annotated entities:
- Post-eligibility: "Capable of providing informed consent."